一位 68 歲男性病患被家人送入急診，主訴為 30 分鐘前開始大量咳血與呼吸困難。病人為一 Goodpasture's syndrome患者，長期於風濕免疫科門診追蹤。意識清楚，血壓為 100/50 mmHg，心跳為 120/分，呼吸速率為 30/分，體溫為 36.5℃，二側肺皆有乾囉聲（crackle）。血氧濃度為 89%（nasal canula：3L/min），血中白血球為 7800/mm3，血色素為 9.8 g/dL，C-reactive protein（CRP）為 1.6 mg/dL，胸部X光顯示二側肺皆有瀰漫性肺泡浸潤（diffuse alveolar infiltration）。依此病人的臨床表現，下列何種疾病最有可能？
A. 肺癌（lung cancer）
B. 肺結核（pulmonary tuberculosis）
C. 肺炎（pneumonia）
D. 肺出血（pulmonary hemorrhage）

正確答案：D. 肺出血（pulmonary hemorrhage）